Clinical trial exclusion criterion:
History or other evidence of chronic pulmonary disease associated with functional limitation. Severe cardiac disease (e.g., NYHA Functional Class III or IV, myocardial infarction within 6 months, ventricular tachyarrhythmias requiring ongoing treatment, unstable angina or other significant cardiovascular diseases).

Annotated entities:
- Condition: "chronic pulmonary disease"
- Condition: "functional limitation"
- Qualifier: "Severe"
- Condition: "cardiac disease"
- Measurement: "NYHA"
- Value: "Functional Class III or IV"
- Condition: "myocardial infarction"
- Temporal: "within 6 months"
- Condition: "ventricular tachyarrhythmias"
- Temporal: "ongoing"
- Procedure: "treatment"
- Condition: "unstable angina"
- Qualifier: "other"
- Qualifier: "significant"
- Condition: "cardiovascular diseases"